Organic diseases of the digestive system (gastro-oesophageal reflux disease (GERD), ulcer, chronic pancreatitis, cholelithiasis, fatty liver disease, hepatitis, cirrhosis of liver, etc.) .

The above is a clinical trial exclusion criterion. Annotated with entity spans:
[Condition: Organic diseases] of the [Qualifier: digestive system] ([Condition: gastro-oesophageal reflux disease (GERD)], [Condition: ulcer], [Condition: chronic pancreatitis], [Condition: cholelithiasis], [Condition: fatty liver disease], [Condition: hepatitis], [Condition: cirrhosis of liver], etc.) .